Clinical trial exclusion criterion:
Has or is suspected of having a family or personal history of malignant hyperthermia.

Entity relations:
- Has_context("malignant hyperthermia", "family")
- OR("family", "personal history")